Women without PCOS as defined by the Rotterdam criteria.

The above is a clinical trial inclusion criterion. Annotated with entity spans:
Women [Negation: without] [Condition: PCOS] as defined by the [Qualifier: Rotterdam criteria].